Clinical trial exclusion criterion:
don't have Diabetes and abnormal metabolism of sugar

Entity relations:
- Has_negation("Diabetes", "don't have")
- OR("Diabetes", "abnormal metabolism of sugar")